Clinical trial exclusion criterion:
Congestive Heart Failure (CHF)

Annotated entities:
- Condition: "Congestive Heart Failure (CHF)"